Clinical trial exclusion criterion:
preoperative history of schizophrenia, epilepsy, parkinsonism, use of cholinesterase inhibitor, inability to communicate in the preoperative period (coma, profound dementia, or language barrier).

Annotated entities:
- Temporal: "history"
- Condition: "schizophrenia"
- Temporal: "preoperative"
- Condition: "epilepsy"
- Condition: "parkinsonism"
- Drug: "cholinesterase inhibitor"
- Condition: "inability to communicate"
- Condition: "coma"
- Condition: "profound dementia"
- Condition: "language barrier"